What does a PET (Positron Excitation Tomography) measure?

Positron emission tomography (PET) allows the quantitative measurement of regional cerebral flow (rCBF) in humans in quantitative terms